Patients with >14 follicles on day of trigger

The above is a clinical trial exclusion criterion. Annotated with entity spans:
Patients with [Value: >14] [Measurement: follicles] [Temporal: on day of trigger]